一名 55 歲男性，常有復發性副鼻竇感染，檢驗數據顯示紅血球沉降速率上升，抗中性球細胞質抗體（Anti-neutrophil cytoplasmic antibody; ANCA）呈現陽性細胞質型（Cytoplasmic）ANCA，但核週型（Perinuclear）ANCA 呈陰性反應，病人同時發生快速腎功能變壞及少尿。下列病理變化中何者最能代表其腎絲球病變？
A. Crescentic membranous proliferative glomerulonephritis
B. IgA crescentic glomerulonephritis
C. Pauci-immune crescentic glomerulonephritis
D. Acute（postinfectious）proliferative glomerulonephritis

正確答案：C. Pauci-immune crescentic glomerulonephritis